Clinical trial exclusion criterion:
Previous participation in this study

Annotated entities:
- Competing_trial: "Previous participation in this study"